Clinical trial inclusion criterion:
OR any FEV1 with chronic supplemental oxygen requirement at rest and/or with exertion

Annotated entities:
- Non-query-able: "OR any FEV1"
- Observation: "chronic supplemental oxygen requirement"
- Qualifier: "at rest"
- Qualifier: "with exertion"
- Parsing_Error: "and/or"